Patient aged 18 years or older.

The above is a clinical trial inclusion criterion. Annotated with entity spans:
Patient [Person: aged] [Value: 18 years or older].